關於全人工髖關節置換術（total hip replacement）術後的復健，下列敘述何者正確？
A. 使用骨泥（cement）固定者，術後當天就可以嘗試下床走路
B. 手術後的併發症以前向脫位（anterior dislocation）最為常見
C. 手術後最好使用內收護枕（adduction pillow）加以保護
D. 手術後應該避免髖部外展（abduction）及外轉（external rotation）的動作

正確答案：A. 使用骨泥（cement）固定者，術後當天就可以嘗試下床走路